Clinical trial exclusion criterion:
Inducers of p-glycoprotein

Annotated entities:
- Drug: "Inducers of p-glycoprotein"